Hypersensitivity to, or disability to take immunosuppressive drugs.

The above is a clinical trial exclusion criterion. Annotated with entity spans:
[Condition: Hypersensitivity] to, or [Condition: disability] to take [Drug: immunosuppressive drugs].